En el tratamiento correcto de los residuos sanitarios:
1. La recogida de residuos sanitarios es independiente a los criterios de asepsia, inocuidad y economía.
2. El primer paso a seguir es la correcta separación basándose en su clasificación.
3. Los residuos del grupo I van en recipientes rígidos y a prueba de pinchazos.
4. Los residuos de los grupos II y III se recogen en bolsas y recipientes que tengan un volumen superior a 70 litros.

Respuesta correcta: 2. El primer paso a seguir es la correcta separación basándose en su clasificación.